Serious medical comorbidities

The above is a clinical trial exclusion criterion. Annotated with entity spans:
[Qualifier: Serious] [Condition: medical comorbidities]